Unwilling to discontinue anti-TNF agent

The above is a clinical trial exclusion criterion. Annotated with entity spans:
[Mood: Unwilling] to [Procedure: discontinue] [Drug: anti-TNF agent]